Existing a second malignancy within 5 years

The above is a clinical trial exclusion criterion. Annotated with entity spans:
Existing a [Condition: second malignancy] [Temporal: within 5 years]